Clinical trial exclusion criterion:
Severe renal impairment (Class 3 or worse kidney disease)

Annotated entities:
- Condition: "Severe renal impairment"
- Parsing_Error: "Class 3 or worse kidney disease"